Clinical trial exclusion criterion:
Subjects with a significant risk of violent behaviour or a significant risk of committing suicide based on history or investigator's judgment.

Annotated entities:
- Observation: "violent behaviour"
- Condition: "committing suicide"
- Mood: "significant risk"
- Mood: "significant risk"